醫院管理工作常利用平衡計分卡（balanced scorecard）來提昇醫院整體表現，對於平衡計分卡的描述，下列何者錯誤？
A. 將組織願景轉換成目標與度量
B. 將策略轉換成具體行動
C. 包含四個構面：財務、顧客、企業內部流程、學習與成長
D. 目的在探討組織現階段架構是否完整

正確答案：D. 目的在探討組織現階段架構是否完整